Clinical trial inclusion criterion:
Patients with acute throat diseases: pharyngitis, tonsillitis, pharyngotonsillitis

Entity relations:
- Subsumes("acute throat diseases", "pharyngitis")
- OR("pharyngitis", "tonsillitis", "pharyngotonsillitis")